Patients with other factors causing liver diseases.

The above is a clinical trial exclusion criterion. Annotated with entity spans:
[Non-query-able: Patients with other factors causing liver diseases].